History of depression.

The above is a clinical trial exclusion criterion. Annotated with entity spans:
[Temporal: History of] [Condition: depression].